Clinical trial inclusion criterion:
T1-3 N0 M0 adenocarcinoma of the prostate

Annotated entities:
- Measurement: "T"
- Value: "1-3"
- Measurement: "N"
- Measurement: "M"
- Value: "0"
- Value: "0"
- Condition: "adenocarcinoma"
- Qualifier: "prostate"